Describe PWMScan

PWMScan is a fast web-based tool for scanning entire genomes with a position-specific weight matrix. It's a fast and cheap way to scan a large portion of an entire genome with a small amount of time.